Clinical trial exclusion criterion:
allergy to metformin

Annotated entities:
- Condition: "allergy"
- Drug: "metformin"